因神經受損而使得闊筋膜張肌（tensor fasciae latae）退化萎縮，下列何者可能也會受影響？
A. 臀大肌
B. 臀中肌
C. 梨狀肌
D. 上孖肌

正確答案：B. 臀中肌